Clinical trial inclusion criterion:
Implanted Fineline-II-leads (BSCI), MRI conditional

Annotated entities:
- Device: "Implanted Fineline-II-leads"
- Device: "BSCI"
- Qualifier: "MRI conditional"